Which is the master oncogenic transcription factor in T-cell acute lymphoblastic leukemia?

The oncogenic transcription factor TAL1/SCL induces an aberrant transcriptional program in T-cell Acute lymphoblastic Leukemia (T-ALL) cells.